Clinical trial inclusion criterion:
1. Diagnosed with symptomatic sacral perineurial cysts(e.g., lumbosacral or perineal pain, fecal or urinary functions change, sexual function change, lower limb radiation pain, muscle abate, paresthesia, etc)

Annotated entities:
- Condition: "sacral perineurial cysts("
- Qualifier: "symptomatic"
- Condition: "perineal pain"
- Condition: "lumbosacral pain"
- Condition: "urinary functions change"
- Condition: "functions change, fecal"
- Condition: "sexual function change"
- Condition: "lower limb radiation pain"
- Condition: "muscle abate"
- Condition: "paresthesia"